La constante de equilibrio estándar para una reacción entre gases ideales:
1. Depende de las cantidades iniciales de los reactivos.
2. Toma distintos valores si la reacción se realiza a distintas presiones.
3. Depende del volumen del recipiente en el que se realiza la reacción.
4. Solo depende de la temperatura.
5. Depende de la naturaleza de los gases.

Respuesta correcta: 4. Solo depende de la temperatura.